Clinical trial exclusion criteria:
Atrial fibrillation of new onset or when rate control has been difficult
Known bigemini/trigeminy
Prior CABG surgery
Allergic to contrast
Advanced renal impairment
Significant valve disease (severe aortic stenosis or regurgitation; severe mitral regurgitation)
Life expectancy <12 months
Inclusion in another trial without prior agreement with CI

Annotated entities:
- Condition: "Atrial fibrillation"
- Temporal: "new onset"
- Condition: "rate control has been difficult"
- Condition: "bigemini"
- Condition: "trigeminy"
- Temporal: "Prior"
- Procedure: "CABG surgery"
- Condition: "Allergic"
- Drug: "contrast"
- Condition: "Advanced renal impairment"
- Condition: "valve disease"
- Qualifier: "severe"
- Condition: "aortic stenosis"
- Condition: "regurgitation"
- Condition: "mitral regurgitation"
- Qualifier: "severe"
- Observation: "Life expectancy"
- Value: "<12 months"
- Competing_trial: "Inclusion in another trial without prior agreement with CI"